Women aged 25-75 years old.

The above is a clinical trial inclusion criterion. Annotated with entity spans:
[Person: Women] [Person: aged] [Value: 25-75 years old].